history of substance abuse (except painkillers)

The above is a clinical trial exclusion criterion. Annotated with entity spans:
history of [Condition: substance abuse] ([Negation: except] [Drug: painkillers])